Clinical trial exclusion criterion:
Untreated thyroid disease;

Entity relations:
- Has_qualifier("thyroid disease", "Untreated")